A concentration of LDL-cholesterol above 100 mg / dl, in the month prior to inclusion.

The above is a clinical trial inclusion criterion. Annotated with entity spans:
A concentration of [Measurement: LDL-cholesterol] [Value: above 100 mg / dl], [Temporal: in the month prior to inclusion].